Unwillingness or doubtful capacity to comply with the protocol

The above is a clinical trial exclusion criterion. Annotated with entity spans:
[Post-eligibility: Unwillingness or doubtful capacity to comply with the protocol]